G6PD deficiency (as determined by FST)

The above is a clinical trial exclusion criterion. Annotated with entity spans:
[Condition: G6PD deficiency] (as determined by FST)